Which type of cells protect Haematopoietic stem and progenitor cells (HSPCs) from ultraviolet-light-induced DNA damage in aquatic vertebrates?

Melanocytes protect Haematopoietic stem and progenitor cells (HSPCs) from ultraviolet-light-induced DNA damages in aquatic vertebrates.